Total cholesterol >280 mg/dL

The above is a clinical trial exclusion criterion. Annotated with entity spans:
[Measurement: Total cholesterol] [Value: >280 mg/dL]